Clinical trial exclusion criterion:
History of myocardial infarction within 6 months prior to randomization.

Entity relations:
- Has_index("within 6 months prior to randomization", "randomization")
- Has_temporal("myocardial infarction", "within 6 months prior to randomization")